Clinical trial exclusion criterion:
no history of allergy to drugs such as, but not limited to, sulphonamides and penicillins

Entity relations:
- AND("allergy", "sulphonamides")
- Has_temporal("allergy", "history")
- OR("sulphonamides", "penicillins")